List 3 conventional synthetic DMARDs.

Three conventional synthetic (cs) DMARDs include methotrexate (MTX), leflunomide, and sulfasalazine.